下列那些接受器被刺激時，可導致肺通氣量（ventilation）增加？①周邊化學接受器 ②中樞化學接 受器 ③肺牽扯性接受器（pulmonary stretch receptors）
A. ①②③
B. ①②
C. ①③
D. ③

正確答案：B. ①②